下列病患中，何者並不適宜成為心臟移植的受贈者？
A. 63歲男性罹患嚴重冠狀動脈疾病，所有內科療法及外科手術療法皆無法改善心肌血液灌注
B. 50歲男性罹患肥大性心肌病變，經心肌切除手術後仍為末期心衰竭
C. 55歲男性罹患末期心衰竭以及肺氣腫合併肺高壓者（pulmonary vascular resistance > 5 Wood units）
D. 22歲女性罹患良性心臟內腫瘤合併反覆性心室性頻脈，無法以外科手術切除者

正確答案：C. 55歲男性罹患末期心衰竭以及肺氣腫合併肺高壓者（pulmonary vascular resistance > 5 Wood units）